Which are the Yamanaka factors?

The Yamanaka factors are the OCT4, SOX2, MYC, and KLF4 transcription factors